Clinical trial exclusion criterion:
Subjects were not to use any prescription medication within 14 days prior to or during the study.

Annotated entities:
- Drug: "prescription medication"
- Temporal: "within 14 days prior to the study"
- Temporal: "during the study"
- Negation: "not"